Clinical trial exclusion criterion:
Medical history of chronic psychiatric disease

Annotated entities:
- Temporal: "history"
- Condition: "chronic psychiatric disease"